常存在鴿糞中，會造成腦膜炎之致病菌為：
A. 申克氏孢絲菌（Sporothrix schenckii）
B. 黃色麴菌（Aspergillus flavus）
C. 新型隱球菌（Cryptococcus neoformans）
D. 白色念珠菌（Candida albicans）

正確答案：C. 新型隱球菌（Cryptococcus neoformans）